Clinical trial inclusion criterion:
Primary Sjögren's syndrome with the diagnosis made by the American-European criteria.

Annotated entities:
- Condition: "Primary Sjögren's syndrome"
- Qualifier: "American-European criteria"